Clinical trial inclusion criterion:
Male or female outpatients aged at least 18 years and not more than 45 years.

Entity relations:
- Has_value("aged", "at least 18 years and not more than 45 years")
- OR("Male", "female")